¿Con qué objetivo proponen Foa y Rothbaum (1998) la Narrativa Reformulada del Trauma en su propuesta de intervención en el TEPT?:
1. Identificar los estímulos activadores de los síntomas.
2. Reducir la frecuencia de imágenes intrusivas.
3. Proporcionar información que desmienta las creencias relacionadas con el trauma.
4. Ayudar a recordar la experiencia de modo que pueda ser asimilada en la memoria autobiográfica de la persona.
5. Dirigir la atención plena del paciente desde sus pensamientos hacia el mundo externo.

Respuesta correcta: 4. Ayudar a recordar la experiencia de modo que pueda ser asimilada en la memoria autobiográfica de la persona.